Clinical trial inclusion criterion:
Are negative for human immunodeficiency virus (HIV) infection at screening

Entity relations:
- Has_negation("human immunodeficiency virus (HIV)", "negative")
- Has_temporal("human immunodeficiency virus (HIV)", "at screening")